Patient has demonstrated compliance, as assessed by the investigator, with the parent study protocol requirements Willingness and ability to comply with scheduled visits, treatment plans and any other study procedures

The above is a clinical trial inclusion criterion. Annotated with entity spans:
[Post-eligibility: Patient has demonstrated compliance, as assessed by the investigator, with the parent study protocol requirements Willingness and ability to comply with scheduled visits, treatment plans and any other study procedures]